Clinical trial inclusion criterion:
Previous treatment with any cell-depleting therapies

Entity relations:
- Has_temporal("cell-depleting therapies", "Previous")